Male or Female.

The above is a clinical trial inclusion criterion. Annotated with entity spans:
[Person: Male] or [Person: Female].